Clinical trial inclusion criterion:
Persistent primary or recurrent trans-sphincteric anal fistula

Annotated entities:
- Condition: "trans-sphincteric anal fistula"
- Multiplier: "recurrent"
- Multiplier: "primary"